Clinical trial exclusion criterion:
13. Prior treatment in any other interventional clinical trial within 4 weeks prior to Day 1 of the study.

Entity relations:
- Has_temporal("treatment", "Prior")